Clinical trial inclusion criterion:
Presentation of moderate to severe depressive symptoms (Montgomery-Asberg Rating Scale: MADRS = 18 at time of study entry or = 24 at any time during study)

Entity relations:
- Has_qualifier("depressive symptoms", "moderate to severe")
- Subsumes("Montgomery-Asberg Rating Scale", "MADRS")
- Has_temporal("= 18", "at time of study entry")
- Has_temporal("= 24", "at any time during study")
- Has_value("Montgomery-Asberg Rating Scale", "= 18")
- Subsumes("depressive symptoms", "Montgomery-Asberg Rating Scale")
- OR("= 18", "= 24")